Clinical trial exclusion criterion:
Medical condition with safety deemed to be category 3 or 4 when using a combined hormonal contraceptive, as determined by the Center for Disease Control Medical Eligibility Criteria: current or past history of breast cancer, severe decompensated cirrhosis, history of deep vein thrombosis or pulmonary embolus, diabetes with nephropathy/retinopathy/neuropathy or other vascular disease diagnosed more than 20 years ago, current symptomatic gallbladder disease, hypertension, ischemic heart disease, known thrombogenic mutations, hepatocellular adenoma, malignant hepatoma, multiple risk factors for atherosclerotic cardiovascular disease, multiple sclerosis with prolonged immobility, history of peripartum cardiomyopathy, cigarette smoking and =35yo, history of complicated solid organ transplant, history of stroke, history of superficial venous thrombosis not associated with catheter, systemic lupus erythematosus with positive antiphospholipid antibodies, valvular heart disease complicated by pulmonary hypertension or atrial fibrillation or bacterial endocarditis, and acute viral hepatitis

Entity relations:
- Has_temporal("breast cancer", "history")
- Has_temporal("history", "current")
- Has_qualifier("cirrhosis", "decompensated")
- Has_qualifier("cirrhosis", "severe")
- Has_temporal("nephropathy", "more than 20 years ago")
- AND("diabetes", "nephropathy")
- Has_mood("atherosclerotic cardiovascular disease", "risk factors")
- Has_multiplier("risk factors", "multiple")
- AND("multiple sclerosis", "prolonged immobility")
- Has_value("yo", "=35yo")
- Has_temporal("peripartum cardiomyopathy", "history")
- Has_value("antiphospholipid antibodies", "positive")
- AND("systemic lupus erythematosus", "antiphospholipid antibodies")
- Has_qualifier("superficial venous thrombosis", "not associated")
- AND("not associated", "catheter")
- Has_temporal("superficial venous thrombosis", "history")
- Has_temporal("stroke", "history")
- Has_temporal("complicated solid organ transplant", "history")
- Has_qualifier("gallbladder disease", "symptomatic")
- Has_temporal("gallbladder disease", "current")
- Subsumes("safety category", "Center for Disease Control Medical Eligibility Criteria")
- Has_value("safety category", "3 or 4")
- AND("safety category", "combined hormonal contraceptive")
- AND("Medical condition", "safety category")
- Subsumes("Medical condition", "breast cancer")
- OR("current", "past")
- OR("nephropathy", "other", "neuropathy", "retinopathy", "vascular disease")
- OR("pulmonary hypertension", "atrial fibrillation", "bacterial endocarditis")
- OR("gallbladder disease", "hypertension", "ischemic heart disease")
- OR("nephropathy", "thrombogenic mutations", "hepatocellular adenoma", "malignant hepatoma", "valvular heart disease", "acute viral hepatitis", "systemic lupus erythematosus", "superficial venous thrombosis", "stroke", "complicated solid organ transplant", "atherosclerotic cardiovascular disease", "multiple sclerosis", "peripartum cardiomyopathy", "cigarette smoking", "gallbladder disease")